Currently residing in Manitoba

The above is a clinical trial inclusion criterion. Annotated with entity spans:
[Observation: Currently residing] in [Visit: Manitoba]